Clinical trial exclusion criterion:
History of previous open-laparotomy.

Entity relations:
- Has_temporal("open-laparotomy", "previous")
- Has_temporal("open-laparotomy", "History")